Clinical trial exclusion criterion:
On colchicine chronically

Annotated entities:
- Drug: "colchicine"
- Multiplier: "chronically"